Clinical trial exclusion criterion:
Beck's Depression Inventory (BDI) =14

Entity relations:
- Has_value("Beck's Depression Inventory (BDI)", "=14")